Presence of hemodynamically relevant stenosis of one artery (i.e., the infarct-related artery) confirmed by coronary angiography (CAG), with the occlusion of other arteries not exceeding 30%.

The above is a clinical trial inclusion criterion. Annotated with entity spans:
Presence of [Qualifier: hemodynamically relevant] [Condition: stenosis of] [Multiplier: one] artery (i.e., the [Condition: infarct-related artery]) confirmed by [Procedure: coronary angiography] ([Procedure: CAG]), with the [Condition: occlusion of other arteries] [Multiplier: not exceeding 30%].